Clinical trial exclusion criterion:
Drugs known to induce QT interval prolongation and/or induce Torsades de pointes unless best available drug required to treat life-threatening conditions

Annotated entities:
- Drug: "Drugs known to induce QT interval prolongation"
- Drug: "Drugs known to induce Torsades de pointes"
- Non-representable: "unless best available drug required to treat life-threatening conditions"